Clinical trial exclusion criterion:
Any other patients judged by the investigator to be unsuitable for the trial

Annotated entities:
- Non-query-able: "Any other patients judged by the investigator to be unsuitable for the trial"